Clinical trial inclusion criterion:
Women of Caucasian origin

Annotated entities:
- Condition: "Caucasian origin"
- Person: "Women"